B 細胞於結合抗原活化時，因為沒有獲得 T 細胞協助的遺傳疾病：高 IgM 症候群（hyper-IgM syndrome），常是因為那一個基因的缺損所致？
A. DNA helicase
B. Bruton's tyrosine kinase（Btk）
C. CD40 ligand（CD40L）
D. Recombination-activating gene（RAG）

正確答案：C. CD40 ligand（CD40L）